Clinical trial inclusion criterion:
Have diagnosed COPD stage III or IV according to GOLD criteria: a baseline post-bronchodilator Forced Expiratory Volume, measured at 1 second (FEV1) <50% of predicted normal and a baseline post- bronchodilator FEV1/Inspiratory Vital Capacity (IVC) ratio <70%.

Entity relations:
- Has_value("GOLD criteria", "stage III or IV")
- AND("COPD", "GOLD criteria")
- Has_value("Forced Expiratory Volume, measured at 1 second (FEV1)", "<50% of predicted normal")
- Has_temporal("Forced Expiratory Volume, measured at 1 second (FEV1)", "post-bronchodilator")
- Has_value("FEV1/Inspiratory Vital Capacity (IVC) ratio", "<70%")
- Has_temporal("FEV1/Inspiratory Vital Capacity (IVC) ratio", "post- bronchodilator")